Clinical trial exclusion criterion:
Women of childbearing potential who are or might be pregnant at the time of study enrollment (method of assessment upon physician discretion)

Annotated entities:
- Condition: "childbearing potential"
- Person: "Women"
- Observation: "are or might be"
- Condition: "pregnant"
- Temporal: "at the time of study enrollment"